Clinical trial exclusion criterion:
Coadministration of more than 20 mg atorvastatin; 10 mg rosuvastatin; 20 mg of fluvastatin, lovastatin or simvastatin

Annotated entities:
- Multiplier: "more than 20 mg"
- Drug: "atorvastatin"
- Multiplier: "more than 10 mg"
- Multiplier: "more than 20 mg"
- Drug: "rosuvastatin"
- Drug: "fluvastatin"
- Drug: "lovastatin"
- Drug: "simvastatin"